Clinical trial exclusion criterion:
Participants currently receiving any type of anticoagulation or blood thinning medications, including heparin, low molecular weight heparins, Plavix, aspirin, NSAIDS

Annotated entities:
- Drug: "anticoagulation"
- Drug: "blood thinning medications"
- Drug: "heparin"
- Drug: "low molecular weight heparins"
- Drug: "Plavix"
- Drug: "aspirin"
- Drug: "NSAIDS"